El Síndrome de Williams-Beuren se caracteriza por una microdeleción del brazo largo del cromosoma:
1. 4.
2. 22.
3. 15.
4. 17.
5. 7.

Respuesta correcta: 5. 7.